obtained consent

The above is a clinical trial inclusion criterion. Annotated with entity spans:
[Non-query-able: obtained consent]